Children between the ages of 4-18 with incomplete ASIA C or D spinal cord injuries at least 12 months before study enrolment

The above is a clinical trial inclusion criterion. Annotated with entity spans:
[Person: Children] between the [Person: ages] of [Value: 4-18] with [Qualifier: incomplete] [Measurement: ASIA] [Value: C or D] [Condition: spinal cord injuries] [Temporal: at least 12 months before study enrolment]